Clinical trial inclusion criterion:
Symptomatic paroxysmal AF who had at least one AF episode electrocardiographically documented within one (1) year prior to enrollment. Documentation may include electrocardiogram (ECG); Transtelephonic monitoring (TTM), Holter monitor or telemetry strip

Annotated entities:
- Qualifier: "Symptomatic"
- Condition: "paroxysmal AF"
- Multiplier: "at least one"
- Condition: "AF episode"
- Procedure: "electrocardiographically"
- Qualifier: "electrocardiographically documented"
- Temporal: "within one (1) year prior to enrollment"
- Reference_point: "enrollment"
- Procedure: "electrocardiogram (ECG)"
- Procedure: "Transtelephonic monitoring (TTM)"
- Procedure: "Holter monitor"
- Procedure: "telemetry strip"